一對在外商公司工作的美國白人夫婦將 6 個月大的女兒送至急診，據他們描述小孩在兩週前開始吃麥粉等副食品後就出現腹瀉，活動力下降的現象，體重減輕了 0.5 公斤。十二指腸切片檢查發現腸黏膜有明顯萎縮以及小腸絨毛（villi）消失的情形，在停止餵食副食品後症狀明顯改善。則下列何者為最有可能之診斷？
A. celiac sprue
B. Hirschsprung's disease
C. Whipple's disease
D. lactase deficiency

正確答案：A. celiac sprue